Un diodo emisor de luz:
1. Es lo mismo que una celda fotovoltaica.
2. Es el inverso a una celda fotovoltaica.
3. Es lo mismo que una celda fotogalvánica.
4. Es el inverso de una celda fotogalvánica.
5. Es equivalente a una celda fotoquímica.

Respuesta correcta: 2. Es el inverso a una celda fotovoltaica.